Administration of electrical or chemical cardioversion before screening

The above is a clinical trial exclusion criterion. Annotated with entity spans:
Administration of [Procedure: electrical] or [Procedure: chemical cardioversion] [Temporal: before screening]